先天性甲狀腺低能症患兒很少出現下列那一項特徵？
A. 稽延性黃疸（prolonged jaundice）
B. 後囟門（posterior fontanel）寬超過 0.5 公分
C. 腹瀉
D. 臍疝氣（umbilical hernia）

正確答案：C. 腹瀉